一位3歲孩童從嬰兒開始就罹患異位性皮膚炎（atopic dermatitis），最近皮膚有些地方發現滲液（ooze）及結痂（crust）現象，他最有可能合併何種感染？
A. Candida albicans
B. Staphylococcus aureus
C. Haemophilus influenzae
D. Mycobacterium tuberculosis

正確答案：B. Staphylococcus aureus